一位一向在健康檢查時，血液常規檢查都未發現異常的媽媽（某一次結果為 Hb: 13.5g/dL, MCV: 85 fL, MCH: 27 pg），卻發現她 5 歲的女兒被診斷為血色素 H 疾病（Hb H disease）。下列的那一個血色素基因形式最可能是媽媽的？
A. ß0/A
B. -α/-α
C. -α/αα
D. - -/αα

正確答案：C. -α/αα